Which drugs are included in the CABENUVA pill?

Cabenuva contains cabotegravir and rilpivirine. It is used for treatment of HIV.